What is the LINCS Program?

The library of Integrated Network-based Cellular Signatures (LINCS) program is a national consortium funded by the NIH to generate a diverse and extensive reference library of cell-based perturbation-response signatures, along with novel data tools to improve our understanding of human diseases at the systems level.